Clinical trial exclusion criterion:
patent foramen ovale with atrial septal aneurysm

Annotated entities:
- Condition: "patent foramen ovale"
- Condition: "atrial septal aneurysm"